下列各項有關肉毒桿菌毒素（botulism toxin）造成嚴重中毒臨床表現之敘述，何者最不可能？
A. 複視
B. 吞嚥困難
C. 呼吸困難
D. 神智不清

正確答案：D. 神智不清